La inhibición de la 3-hidroxi-metilglutaril-CoA reductasa producirá:
1. Una reducción de la concentración de colesterol.
2. Una reducción de la concentración de acetilCoA.
3. Un aumento de la concentración de hormonas de esteroideas.
4. Una reducción de la concentración de triacilglicéridos.

Respuesta correcta: 1. Una reducción de la concentración de colesterol.